Clinical trial inclusion criterion:
7. Subject and/or Primary Caregiver must be competent to follow all study procedures.

Annotated entities:
- Parsing_Error: "7."
- Post-eligibility: "Subject and/or Primary Caregiver must be competent to follow all study procedures."
- Non-query-able: "Subject and/or Primary Caregiver must be competent to follow all study procedures"